過敏性鼻炎（allergic rhinitis）的敘述，下列何者錯誤？
A. 盛行率最高的學童慢性過敏性疾病
B. 病人日後罹患氣喘的風險，是無過敏性鼻炎的人的三倍高
C. 常伴隨	過敏性結膜炎發生，且比較容易發生中耳炎及鼻竇炎
D. 嚴重之過敏性鼻炎病人常有鼻塞症狀而影響生活品質，治療需以抗組織胺（anti-histamine agent）和局部鼻用去充血劑（intranasal decongestant）合併治療2到4週，來改善生活品質

正確答案：D. 嚴重之過敏性鼻炎病人常有鼻塞症狀而影響生活品質，治療需以抗組織胺（anti-histamine agent）和局部鼻用去充血劑（intranasal decongestant）合併治療2到4週，來改善生活品質